一位意識不清之頭部外傷患者送達急診，血壓 85/55 mmHg，呼吸每分鐘 30 下，心跳每分鐘 120 下，下列緊急處置何者錯誤？
A. 緊急進行氣管插管
B. 立即給予 2000 mL 乳酸林格式液
C. 床邊腹部超音波檢查
D. 只能使用升壓劑來維持腦部灌流

正確答案：D. 只能使用升壓劑來維持腦部灌流